Clinical trial inclusion criterion:
Age = 18 years old.

Entity relations:
- Has_value("Age", "= 18 years old")